Clinical trial exclusion criterion:
Consumption of daily medications that alter glucose metabolism of GI function (glucocorticoids, psychotropics, narcotics, metoclopramide)

Entity relations:
- Has_multiplier("medications", "daily")
- Has_qualifier("medications", "that alter glucose metabolism of GI function")
- Subsumes("medications", "glucocorticoids")
- OR("glucocorticoids", "metoclopramide", "psychotropics", "narcotics")